Hypersensitivity to the active substance, to FCM or any of its excipients

The above is a clinical trial exclusion criterion. Annotated with entity spans:
[Condition: Hypersensitivity] to the [Drug: active substance], to [Drug: FCM] or any of its [Drug: excipients]